acute cholecystitis within two months

The above is a clinical trial exclusion criterion. Annotated with entity spans:
[Condition: acute cholecystitis] [Temporal: within two months]